Clinical trial exclusion criterion:
Previously treated with mirabegron within 60 days prior to the baseline visit (Visit 2), or previously having failed treatment with mirabegron regardless of duration and timing of treatment.

Entity relations:
- Has_index("within 60 days prior to the baseline visit", "baseline visit")
- Has_temporal("mirabegron", "within 60 days prior to the baseline visit")